Clinical trial exclusion criterion:
Clinically significant pericardial effusion (eg, moderate or larger or with hemodynamic compromise)

Entity relations:
- Has_qualifier("pericardial effusion", "Clinically significant")
- Subsumes("Clinically significant", "moderate or larger")
- OR("moderate or larger", "hemodynamic compromise")